Clinical trial exclusion criterion:
The difference in blood pressure between the selected arm versus non-selected arm is = 20 mmHg for siSBP and = 10 mmHg for siDBP at Visit 1 (screening).

Entity relations:
- Has_qualifier("difference in blood pressure", "selected arm versus non-selected arm")
- Has_value("siSBP", "= 20 mmHg")
- Has_value("siDBP", "= 10 mmHg")
- AND("difference in blood pressure", "siSBP")
- AND("difference in blood pressure", "siDBP")
- Has_temporal("difference in blood pressure", "at Visit 1")